Clinical trial exclusion criteria:
Anticoagulation therapy
Prior CABG.
Active bleeding or at high risk of bleeding
Severe liver or renal disease.
Hypersensitivity to ticagrelor
History of intracranial hemorrhage

Annotated entities:
- Procedure: "Anticoagulation therapy"
- Temporal: "Prior"
- Procedure: "CABG"
- Qualifier: "Active"
- Condition: "bleeding"
- Qualifier: "at high risk"
- Condition: "bleeding"
- Condition: "renal disease"
- Condition: "disease liver"
- Qualifier: "Severe"
- Condition: "Hypersensitivity"
- Drug: "ticagrelor"
- Temporal: "History"
- Condition: "intracranial hemorrhage"